¿Cuál de los siguientes virus de vertebrados presenta como material genético RNA de cadena simple?:
1. Virus del papiloma.
2. Virus de la viruela.
3. Virus de la inmunodeficiencia humana.
4. Rotavirus humanos.
5. Virus de Epstein-Barr.

Respuesta correcta: 3. Virus de la inmunodeficiencia humana.